Before 2019, what neurologic diseases are associated with the tau protein?

Both Alzheimer's Disease and Multiple Sclerosis are associated with tau protein